chronic, metabolic, systemic and endocrine disorders, including hyperandrogenism, hyperprolactinemia, diabetes mellitus and thyroid disease,

The above is a clinical trial exclusion criterion. Annotated with entity spans:
[Condition: chronic], [Condition: metabolic], [Condition: systemic] and [Condition: endocrine disorders], including [Condition: hyperandrogenism], [Condition: hyperprolactinemia], [Condition: diabetes mellitus] and [Condition: thyroid disease],